一位25歲女性病人被診斷為全身性紅斑性狼瘡（systemic lupus erythematosus, SLE），最近一次	尿之RBC 為50～75/HPF（high power field），每日尿蛋白為3.2公克，血中肌酸酐（creatinine）3個月內，由1.2 mg/dL上升至2.4 mg/dL，下列敘述何者錯誤？
A. 腎病理切片最可能是瀰漫增生性腎絲球腎炎（diffuse proliferative glomerulonephritis）
B. 給予靜脈脈衝類固醇治療（pulse steroid therapy）
C. 給予細胞毒性藥物如cyclophosphamide，此藥亦可用脈衝治療方式給予
D. anti-double-stranded DNA抗體檢	值的高低不可以當狼瘡腎炎活性的指標

正確答案：D. anti-double-stranded DNA抗體檢	值的高低不可以當狼瘡腎炎活性的指標